Clinical trial exclusion criterion:
remain intubated in the postoperative period

Entity relations:
- Has_index("in the postoperative period", "postoperative period")
- Has_temporal("intubated", "in the postoperative period")
- multi("intubated", "intubated")